胰臟中最常見之惡性腫瘤是：
A. 腺胞細胞癌（acinar cell carcinoma）
B. 胰管癌（ductal carcinoma）
C. Solid and cystic tumor
D. Islet cell tumor

正確答案：B. 胰管癌（ductal carcinoma）